Clinical trial inclusion criterion:
Patients must agree to have a 20 cc blood sample drawn in addition to routine labs with each cycle of chemotherapy.

Entity relations:
- Has_qualifier("blood sample drawn", "20 cc")
- Has_multiplier("blood sample drawn", "with each cycle of chemotherapy")
- AND("blood sample drawn", "agree to")
- Has_multiplier("routine labs", "with each cycle of chemotherapy")
- AND("routine labs", "agree to")